Evidence of drug and/or alcohol abuse (20g/day for women & 30g/day for men).

The above is a clinical trial exclusion criterion. Annotated with entity spans:
Evidence of [Condition: drug] and/or [Condition: alcohol abuse] ([Multiplier: 20g/day] for [Person: women] & [Multiplier: 30g/day] for [Person: men]).